Clinical trial inclusion criterion:
Patient presents a normal eye fundus.

Entity relations:
- Has_value("eye fundus", "normal")
- AND("normal eye fundus", "eye fundus")